有關磷酸二酯酶（phosphodiesterase）抑制劑，治療男性勃起功能障礙的機轉，下列何者正確？
A. Sildenafil（Viagra）主要作用是抑制磷酸二酯酶第6及11型
B. 磷酸二酯酶第5型促使環磷酸腺苷（cAMP）代謝為5'環磷酸腺苷（5'AMP）
C. 可直接引發勃起機制
D. 不能與硝酸鹽藥物（nitrates）同時服用

正確答案：D. 不能與硝酸鹽藥物（nitrates）同時服用